Cohort 2: Newly-diagnosed high-grade glioma (World Health Organization [WHO] grade 3 or 4)

The above is a clinical trial inclusion criterion. Annotated with entity spans:
Cohort 2: Newly-diagnosed [Condition: high-grade glioma] ([Measurement: World Health Organization [WHO] grade] [Value: 3 or 4])